¿Cuáles de los siguientes déficits es una alteración del ciclo de la urea?:
1. Hipoxantina oxidasa.
2. Arginina mono oxigenasa.
3. Arginosuccionato sintetasa.
4. Tirosinasa.

Respuesta correcta: 3. Arginosuccionato sintetasa.